the last vaccination intervals = 14 days

The above is a clinical trial inclusion criterion. Annotated with entity spans:
the [Observation: last vaccination intervals] [Value: = 14 days]